Clinical trial inclusion criterion:
Patients with an on-going agitation episode, or with a previous one within the 6 months prior to screening, attended and managed in the hospital setting.

Annotated entities:
- Condition: "agitation episode"
- Temporal: "within the 6 months prior to screening"
- Reference_point: "screening"